一位 63 歲女性有糖尿病、高血壓及血脂異常病史，她亦有抽菸習慣。下列治療目標，何者最不適當？
A. 控制血中醣化血色素（HbA1C）＜7.0%
B. 控制血中低密度膽固醇＜130 mg/dL
C. 控制血壓＜130/80 mmHg
D. 勸導病人戒菸

正確答案：B. 控制血中低密度膽固醇＜130 mg/dL